Clinical trial exclusion criterion:
Patients with resorbable upper face fillers injection in the past 12 months

Entity relations:
- Has_qualifier("resorbable fillers injection", "upper face")
- Has_temporal("resorbable fillers injection", "in the past 12 months")